Clinical trial exclusion criterion:
Ongoing treatment with statins, fibrates, and/or cation exchange resins within 2 weeks;

Entity relations:
- Has_temporal("treatment", "Ongoing")
- AND("treatment", "statins")
- Has_temporal("treatment", "within 2 weeks")
- OR("statins", "cation exchange resins", "fibrates")